下列菌屬中，何者對鹼性環境的耐受度最高？
A. 螺旋桿菌屬（Helicobacter）
B. 弧菌屬（Vibrio）
C. 假單胞菌屬（Pseudomonas）
D. 奈瑟氏菌屬（Neisseria）

正確答案：B. 弧菌屬（Vibrio）